Thrombin or Xa factor inhibitor;

The above is a clinical trial exclusion criterion. Annotated with entity spans:
[Drug: Thrombin] or [Drug: Xa factor inhibitor];